Clinical trial exclusion criterion:
10. Myocardial infarction within the past 6 months.

Annotated entities:
- Parsing_Error: "10."
- Condition: "Myocardial infarction"
- Temporal: "within the past 6 months"